Clinical trial inclusion criteria:
Age 65 years and older
Hypertension - untreated (Systolic Blood Pressure (SBP) ≥ 140 mm Hg or Diastolic Blood Pressure (DBP) ≥ 90 mm Hg) or treated
Physical limitations evidenced by either:
Score ≤ 10 on the Short Physical Performance Battery OR Walking speed < 1.2 m/sec during 400 m usual-paced test
Sedentary lifestyle, defined as <150 min/wk of moderate physical activity as assessed by CHAMPS questionnaire
Willingness to participate in all study procedures

Annotated entities:
- Person: "Age"
- Value: "65 years and older"
- Condition: "Hypertension"
- Qualifier: "untreated"
- Measurement: "Systolic Blood Pressure (SBP)"
- Value: "≥ 140 mm Hg"
- Measurement: "Diastolic Blood Pressure (DBP)"
- Value: "≥ 90 mm Hg"
- Qualifier: "treated"
- Parsing_Error: "Physical limitations evidenced by either:"
- Measurement: "Short Physical Performance Battery"
- Value: "Score ≤ 10"
- Measurement: "Walking speed"
- Value: "< 1.2 m/sec"
- Procedure: "400 m usual-paced test"
- Condition: "Sedentary lifestyle"
- Value: "<150 min/wk"
- Measurement: "moderate physical activity"
- Procedure: "CHAMPS questionnaire"
- Non-query-able: "Willingness to participate in all study procedures"